下列何者的肌腱會從足底長韌帶（long plantar ligament）前端兩附著點間穿過？
A. 腓短肌（peroneus brevis）
B. 腓長肌（peroneus longus）
C. 脛後肌（tibialis posterior）
D. 脛前肌（tibialis anterior）

正確答案：B. 腓長肌（peroneus longus）